下列何種人體寄生蟲會出現孤雌生殖（parthenogenesis）的現象？
A. 旋毛蟲（Trichinella spiralis）
B. 糞小桿線蟲（Strongyloides stercoralis）
C. 菲律賓毛線蟲（Capillaria philippinensis）
D. 東方毛線蟲（Trichostrongylus orientalis）

正確答案：B. 糞小桿線蟲（Strongyloides stercoralis）